Complications to RYGB. Documented reactive hypoglycaemia, severe dumping (vomiting, diarrhea, severe abdominal pain after food intake)

The above is a clinical trial exclusion criterion. Annotated with entity spans:
[Condition: Complications] to [Procedure: RYGB]. Documented [Condition: reactive hypoglycaemia], [Qualifier: severe] [Condition: dumping] ([Condition: vomiting], [Condition: diarrhea], [Qualifier: severe] [Condition: abdominal pain] [Temporal: after food intake])